Clinical trial exclusion criterion:
Has a known history of, or any evidence of, central nervous system (CNS) metastases and/or carcinomatous meningitis

Entity relations:
- Has_context("central nervous system (CNS) metastases", "evidence")
- Has_temporal("central nervous system (CNS) metastases", "history")
- OR("central nervous system (CNS) metastases", "carcinomatous meningitis")